La actividad piruvato carboxilasa depende del efector alostérico positivo:
1. Succinato.
2. AMP.
3. Isocitrato.
4. Citrato.
5. Acetil CoA.

Respuesta correcta: 5. Acetil CoA.